Clinical trial exclusion criterion:
allergy to Paclitaxel

Entity relations:
- AND("allergy", "Paclitaxel")